Diagnosis of a psychotic disorder.

The above is a clinical trial exclusion criterion. Annotated with entity spans:
Diagnosis of a [Condition: psychotic disorder].